Clinical trial inclusion criterion:
The informed consent has been obtained from the patient.

Annotated entities:
- Non-query-able: "The informed consent has been obtained from the patient."
- Post-eligibility: "The informed consent has been obtained from the patient."